Clinical trial exclusion criterion:
can't understand patient controlled analgesia device refuse trial

Annotated entities:
- Post-eligibility: "can't understand patient controlled analgesia device refuse trial"